What are the diagnostic criteria for hemophagocytic lymphohistiocytosis?

Hemophagocytic lymphohistiocytosis (HLH), diagnosis is based on five criteria (fever, splenomegaly, bicytopenia, hypertriglyceridemia and/or hypofibrinogenemia, and hemophagocytosis).